有關思覺失調症（schizophrenia）之敘述，何者正確？
A. 少有淡漠（blunted）或不適切（inappropriate）的情緒
B. 在罹患此症多年後才開始出現負性症狀（negative symptoms）
C. 連結鬆散（loosening of association）是思考型式（thought form）的症狀
D. 最常見之兩種幻覺為聽幻覺和觸幻覺

正確答案：C. 連結鬆散（loosening of association）是思考型式（thought form）的症狀